English speaking/literate

The above is a clinical trial inclusion criterion. Annotated with entity spans:
[Post-eligibility: English speaking/literate]